Which gene mutations are responsible for isolated Non-compaction cardiomyopathy?

The gene mutations that have been shown to be the causes of isolated non-compaction cardiomyopathy are alpha-tropomyosin, alpha-tropomyosin, troponin T and desmoplakin